Uno de los componentes de las formulaciones inyectables son los conservantes. En esta categoría se incluyen distintos excipientes con mecanismos de acción diferentes. ¿Cuál de los siguientes es utilizado como agente quelante?:
1. Butilhidroxianisol.
2. Ácido etilendiaminotetracético.
3. Ácido ascórbico.
4. Gelato de propilo.
5. Tocoferol.

Respuesta correcta: 2. Ácido etilendiaminotetracético.